What is  Exencephaly?

Exencephaly is a type of cephalic disorder wherein the brain is located outside of the skull